有關構造與橫膈開口的對應，下列何者正確？
A. 胸管－食道裂孔
B. 奇靜脈－主動脈裂孔
C. 迷走神經－下腔靜脈裂孔
D. 交感神經幹－主動脈裂孔

正確答案：B. 奇靜脈－主動脈裂孔